Clinical trial inclusion criterion:
Age 18 years

Annotated entities:
- Person: "Age"
- Value: "18 years"